Had dose increase of anti-TNF agent or DMARD in the last 6 months

The above is a clinical trial exclusion criterion. Annotated with entity spans:
Had [Multiplier: dose increase] of [Drug: anti-TNF agent] or [Drug: DMARD] [Temporal: in the last 6 months]